Approximately how many genes are contained in the X chromosome's non-pseudoautosomal region (non-PAR)?

The number of genes contained in the X chromosome's non-pseudoautosomal region (non-PAR) is 783.